Los programas informáticos de generación de realidad virtual permiten desarrollar un tipo de:
1. Exposición guiada.
2. Exposición simulada.
3. Exposición simbólica.
4. Desensibilización sistemática.

Respuesta correcta: 3. Exposición simbólica.